Diagnosis of T2DM before the age of 60 years of age

The above is a clinical trial inclusion criterion. Annotated with entity spans:
Diagnosis of [Condition: T2DM] [Value: before] the [Person: age] of 60 years of age